林先生今年 36 歲，15 年前開始右眼皮下垂，半年後開始有複視的現象；此後症狀逐漸加重，連左眼也產生一樣的症狀。目前已經兩眼都睜不開，必須用手把眼皮拉開才看得到路，兩個眼睛也都沒有辦法上下左右移動。家族中有多人患同樣的疾病，而且大姨的女兒在 24 歲時因突發性右側肢體無力，被診斷為腦中風；病人姐姐的兒子從 7 歲起就患有癲癇病。病人的腦脊髓液檢查發現其中乳酸（lactic acid）比正常高出很多，肌肉切片在 modified Gomori trichrome stain 下，可見細胞中呈現粗糙的紅色纖維狀物質。此病人最有可能罹患下列那一種疾病？
A. 威爾森氏病（Wilson's disease）
B. 重症肌無力（myasthenia gravis）
C. 甲狀腺疾病（thyroid disease）
D. 粒線體性病變（mitochondrial disease）

正確答案：D. 粒線體性病變（mitochondrial disease）